Clinical trial exclusion criterion:
Morbidly obese with BMI ≥ 40

Annotated entities:
- Condition: "Morbidly obese"
- Measurement: "BMI"
- Value: "≥ 40"